En un patógeno Gram positivo implicado en faringitis y fiebres reumáticas:
1. Staphylococcus aureus.
2. Micrococcus luteus.
3. Moraxella catarrhalis.
4. Haemophilus influenzae.
5. Streptococcus pyogenes.

Respuesta correcta: 5. Streptococcus pyogenes.